Clinical trial exclusion criterion:
Patient is unwilling to discontinue 5-alph reductase inhibitors 1 month after study treatment

Annotated entities:
- Drug: "5-alph reductase inhibitors"
- Temporal: "1 month after study treatment"
- Non-query-able: "Patient is unwilling to discontinue 5-alph reductase inhibitors 1 month after study treatment"